Bilirubin greater than 2 times ULN.

The above is a clinical trial exclusion criterion. Annotated with entity spans:
[Measurement: Bilirubin] [Value: greater than 2 times ULN].